一位神經學檢查均正常的 8 歲女孩，一天內常有上百次突然表情呆滯，動作暫停，對旁人之呼叫無反應，約 10 秒後恢復神智。下列何者敘述為錯誤？
A. 大腦磁振攝影檢查（MRI）結果常為正常
B. 最可能的診斷為兒童良性 rolandic 癲癇（benign rolandic epilepsy）
C. 可被過度換氣（hyperventilation）檢查誘發
D. 每秒 3 次的棘波-慢波複合波（3-Hz spike-and-wave complexes, 3-Hz spike-wave discharges）為其特徵性之腦電圖（EEG）表現

正確答案：B. 最可能的診斷為兒童良性 rolandic 癲癇（benign rolandic epilepsy）